previous chemotherapy

The above is a clinical trial exclusion criterion. Annotated with entity spans:
[Temporal: previous] [Procedure: chemotherapy]